Clinical trial exclusion criterion:
Person who cannot personally provide their consent.

Annotated entities:
- Informed_consent: "Person who cannot personally provide their consent"